Clinical trial exclusion criterion:
5. Untreated urogenital infections (either symptomatic or asymptomatic) within 2 weeks prior to enrollment

Annotated entities:
- Condition: "urogenital infections"
- Qualifier: "Untreated"
- Condition: "symptomatic"
- Condition: "asymptomatic"
- Temporal: "within 2 weeks prior to enrollment"
- Reference_point: "enrollment"